Todas las siguientes son complicaciones habituales del trastorno de ansiedad generalizada no tratado EXCEPTO:
1. Consumo de alcohol y abuso de drogas.
2. Trastornos psicosomáticos.
3. Trastornos depresivos.
4. Trastornos psicóticos.
5. Conductas suicidas.

Respuesta correcta: 4. Trastornos psicóticos.